下列藥物何者的半衰期（half-life）最長？
A. digoxin
B. digitoxin
C. ouabain
D. verapamil

正確答案：B. digitoxin